Clinical trial exclusion criterion:
Has bilateral sacroiliitis Grade 2 or unilateral sacroiliitis Grade 3 or Grade 4

Annotated entities:
- Qualifier: "bilateral"
- Condition: "sacroiliitis"
- Qualifier: "Grade 2"
- Qualifier: "unilateral"
- Condition: "sacroiliitis"
- Qualifier: "Grade 3"
- Qualifier: "Grade 4"